Clinical trial exclusion criterion:
age <18 years;

Entity relations:
- Has_value("age", "<18 years")